孔太太是一位大腸癌末期病人，進入安寧病房時已經意識不清無法辨識家人，完全臥床無法行動，只能進食 少量半固體食物，身體日漸虛弱與消瘦。你認為這時最適當的治療方式是什麼？
A. 放置鼻胃管灌食
B. 使用周邊靜脈導管給予人工營養及水分
C. 放置中央靜脈導管給予全靜脈營養
D. 繼續經口給予可接受的食物

正確答案：D. 繼續經口給予可接受的食物